Clinical trial inclusion criterion:
Has clear corneas and no active ocular disease

Entity relations:
- Has_temporal("ocular disease", "active")
- Has_negation("ocular disease", "no")